3. intrauterine infection

The above is a clinical trial exclusion criterion. Annotated with entity spans:
3. [Condition: intrauterine infection]